What gene is mutated in Huntington's Disease patients?

(HD) is a neurodegenerative disorder that is caused by abnormal expansion of CAG repeats in the HTT gene.